罹患單側上泌尿道癌之病人，日後發生膀胱癌及對側上泌尿道癌之機率分別是：
A. 5～10%和 10～15%
B. 20～25%和 5～10%
C. 30～50%和 2～4%
D. 30～50%和 20～25%

正確答案：C. 30～50%和 2～4%